Clinical trial exclusion criterion:
Severe liver and renal dysfunction

Entity relations:
- Has_qualifier("liver dysfunction", "Severe")
- OR("liver dysfunction", "renal dysfunction")